Cardiovascular disease

The above is a clinical trial inclusion criterion. Annotated with entity spans:
[Condition: Cardiovascular disease]